No previous history of upper gastrointestinal bleeding

The above is a clinical trial inclusion criterion. Annotated with entity spans:
[Negation: No] previous history of [Condition: upper gastrointestinal bleeding]